Clinical trial exclusion criterion:
5. Participating in the other clinical trial within 30 days;

Annotated entities:
- Context_Error: "Participating in the other clinical trial within 30 days;"